Clinical trial exclusion criterion:
Asthma: Subjects with a current diagnosis of asthma. (Subjects with a prior history of asthma are eligible if they also have a current diagnosis of COPD).

Annotated entities:
- Condition: "Asthma"
- Condition: "asthma"
- Temporal: "current"
- Temporal: "prior"
- Temporal: "history"
- Condition: "asthma"
- Condition: "COPD"